Clinical trial exclusion criterion:
use of Insulin, SGLT2-inhibitor, sulfonylurea derivate or a glinide within past 3 months

Entity relations:
- Has_temporal("Insulin", "past 3 months")
- OR("Insulin", "SGLT2-inhibitor", "sulfonylurea derivate", "glinide")